En la endocitosis mediada por receptor interviene:
1. Solo la clatrina.
2. Solo la adaptina.
3. Adaptina y clatrina.
4. Chaperonas.
5. Solo las proteínas de la membrana.

Respuesta correcta: 3. Adaptina y clatrina.